Please list 3 diseases treated with Valtrex(valacyclovir)

Valtrex (valacyclovir) is an antiviral medication used to treat infections with: herpes zoster (shingles), herpes simplex genitalis (genital herpes),
and herpes labialis (cold sores).